HCV, HIV, or HDV coinfection.

The above is a clinical trial exclusion criterion. Annotated with entity spans:
[Condition: HCV], HIV, or [Condition: HDV] [Condition: coinfection].